Desde la epistemología de Piaget, los individuos son capaces de construir nuevos esquemas porque han heredado dos funciones intelectuales que son:
1. Refuerzo y castigo.
2. Organización y adaptación.
3. Asimilación y acomodación.
4. Autorregulación y asimilación.
5. Reacción circular primaria y secundaria.

Respuesta correcta: 2. Organización y adaptación.